La mejor definición de un operador es:
1. El producto de un gen regulador.
2. Un gen regulado de forma constitutiva que produce proteínas reguladoras de un operón.
3. La región de unión del represor en los operones.
4. La secuencia dentro de un operón que dirige el lugar correcto de iniciación de la transcripción.

Respuesta correcta: 3. La región de unión del represor en los operones.